相對而言，下列何者較少發生 BRAF V600E mutation？
A. Breast cancer
B. Colon cancer
C. Malignant melanoma
D. Papillary thyroid carcinoma

正確答案：A. Breast cancer